Clinical trial inclusion criterion:
Neutrophil count: ≥ 1.5 x 109/L

Entity relations:
- Has_value("Neutrophil count", "≥ 1.5 x 109/L")